¿Cuántos cromosomas tendrá un varón con monosomía del cromosoma 7 y nulisomía del cromosoma 8?
1. 43.
2. 45.
3. 44.
4. 42.

Respuesta correcta: 1. 43.